Clinical trial exclusion criterion:
Use of any systemic estrogen, progestin, or DHEA in the eight weeks prior to randomization.

Entity relations:
- Has_temporal("systemic estrogen", "in the eight weeks prior to randomization")
- OR("systemic estrogen", "DHEA", "systemic progestin")